Clinical trial inclusion criterion:
Patients with motor fluctuations

Annotated entities:
- Condition: "motor fluctuations"